What is the association of Disease-Associated STRs (daSTRs) with domain boundaries?

Nearly all disease-associated STRs (daSTRs) are located at boundaries demarcating 3D chromatin domains. For instance, Fragile X syndrome patients exhibit severe boundary disruption in a manner that correlates with local loss of CTCF occupancy and the degree of FMR1 silencing.